Entre las normas de administración de la Nutrición Parenteral, cuál es verdadera:
1. La vía de administración de la NP, podrá utilizarse para la realización de extracciones sanguíneas.
2. La bolsa de NP podrá mantenerse fuera de la nevera hasta su administración.
3. La administración de otros medicamentos intravenosos se podrá realizar por la misma vía de la NP.
4. La solución nutritiva puede estar expuesta a la luz.
5. La infusión se realizará a ritmo constante durante las 24 horas.

Respuesta correcta: 5. La infusión se realizará a ritmo constante durante las 24 horas.